下列何者為傳導性失語症（conduction aphasia）最常發生的病變位置？
A. 弓狀束（arcuate fasciculus）
B. 基底核（basal ganglion）
C. 布洛卡氏（Broca）區
D. 魏尼凱氏（Wernicke）區

正確答案：A. 弓狀束（arcuate fasciculus）